¿Cuál de las siguientes afirmaciones sobre el envejecimiento se corresponde con el enfoque psicosocial conocido como Teoría de la Continuidad?
1. El bienestar en la vejez depende de los roles recién adquiridos.
2. Envejecer con éxito está relacionado con el número de actividades que se realicen.
3. A medida que se envejece es necesario abandonar voluntariamente determinadas actividades.
4. Envejecer de forma saludable implica no desvincularse de los roles sociales.
5. El nivel de actividad en la vejez está en función de la trayectoria vital de la persona.

Respuesta correcta: 5. El nivel de actividad en la vejez está en función de la trayectoria vital de la persona.